Clinical trial exclusion criterion:
Pregnant or nursing (lactating) women, where pregnancy is defined as the state of a female after conception and until the termination of gestation, confirmed by a positive hcG laboratory test.

Annotated entities:
- Observation: "Pregnant"
- Observation: "nursing"
- Person: "women"
- Observation: "lactating"
- Observation: "hcG laboratory test"
- Value: "positive"